Clinical trial exclusion criterion:
Treatment with insulin

Annotated entities:
- Drug: "insulin"